Clinical trial exclusion criterion:
6. Diagnosis of cognitive impairment from other causes (i.e., vitamine B12 and folic acid deficiency, thyroid disorders, metabolic diseases, head trauma, tumor or infections of the central nervous system, normal pressure hydrocephalus).

Entity relations:
- Subsumes("other causes", "vitamine B12 deficiency")
- Has_qualifier("cognitive impairment", "other causes")
- OR("vitamine B12 deficiency", "infections of the central nervous system", "normal pressure hydrocephalus", "folic acid deficiency", "thyroid disorders", "metabolic diseases", "head trauma", "tumor of the central nervous system")